Clinical trial inclusion criterion:
9. Asymptomatic for genital infections at the time of enrollment

Entity relations:
- Has_mood("genital infections", "Asymptomatic")
- Has_temporal("genital infections", "at the time of enrollment")